醫師判讀一項檢查結果時必須知道該檢查的特異度（specificity）。何謂特異度 （specificity）？
A. 檢查結果為陽性的病人中，確實有該項疾病的機率
B. 檢查結果為陰性的病人中，確實沒有該項疾病的機率
C. 有該項疾病的病人中，檢查結果為陽性的機率
D. 沒有該項疾病的病人中，檢查結果為陰性的機率

正確答案：D. 沒有該項疾病的病人中，檢查結果為陰性的機率